Completion of all vaccinations required by the applicable immunization guidelines published by "ständige Impfkommission" (STIKO)

The above is a clinical trial inclusion criterion. Annotated with entity spans:
[Non-query-able: Completion of all vaccinations required by the applicable immunization guidelines published by "ständige Impfkommission" (STIKO)]